有關多囊性卵巢（polycystic ovarian syndrome, PCOS）的治療，何者不適當？
A. Metformin
B. Clomiphene citrate
C. Danazol
D. 腹腔鏡卵巢電燒穿洞術（laproscopic ovarian drilling）

正確答案：C. Danazol